下列何種內科疾病較不易引起次發性情感疾患（secondary mood disorder）？
A. 中風
B. 帕金森症
C. 多發性硬化症（multiple sclerosis）
D. 維他命C缺乏

正確答案：D. 維他命C缺乏